Clinical trial exclusion criterion:
Contraindication to general anesthesia,

Annotated entities:
- Condition: "Contraindication"
- Procedure: "general anesthesia"